What is myelin?

Myelin is a specialized structure of the nervous system that covers the neuron and both enhances electrical conductance and insulates neurons from external risk factors.